Clinical trial exclusion criterion:
TBS with major arterial bleeding requiring suture or mechanical ligation;

Annotated entities:
- Condition: "TBS"
- Condition: "major arterial bleeding"
- Procedure: "mechanical ligation"
- Procedure: "suture"